Clinical trial inclusion criteria:
Adult patients up to age 75 years, undergoing elective, ambulatory, arthroscopic rotator cuff repair.

Annotated entities:
- Person: "Adult"
- Person: "age"
- Value: "up to 75 years"
- Qualifier: "elective"
- Visit: "ambulatory"
- Procedure: "arthroscopic rotator cuff repair"